Women who received metallic fixation, coronary artery stent in recent 3 months; or women who received mechanical valve replacement that is not compatible with MR magnet; or women with aneurysmal clips, pacemakers.

The above is a clinical trial exclusion criterion. Annotated with entity spans:
[Person: Women] who received [Procedure: metallic fixation], [Device: coronary artery stent] in [Temporal: recent 3 months]; or [Person: women] who received [Device: mechanical valve replacement] that is not compatible with MR magnet; or [Person: women] with [Device: aneurysmal clips], [Device: pacemakers].